Clinical trial inclusion criterion:
The presence of at least one lesion that can be accurately assessed at baseline by Computerised Tomography (CT), Magnetic Resonance Imaging (MRI) or plain X-ray and is suitable for repeated assessment

Entity relations:
- Has_qualifier("lesion", "accurately assessed at baseline")
- AND("accurately assessed at baseline", "Computerised Tomography (CT)")
- Has_qualifier("lesion", "suitable for repeated assessment")
- Has_multiplier("lesion", "at least one")
- OR("Computerised Tomography (CT)", "Magnetic Resonance Imaging (MRI)", "plain X-ray")